Clinical trial exclusion criterion:
infectious, suppurative and allergic dermatosis

Entity relations:
- OR("infectious dermatosis", "suppurative dermatosis", "allergic dermatosis")